Clinical trial exclusion criterion:
Previous surgical management of ovarian pathology

Annotated entities:
- Procedure: "surgical management"
- Condition: "ovarian pathology"
- Temporal: "Previous"